Sleep apnea or morbid obesity with possible sleep apnea

The above is a clinical trial exclusion criterion. Annotated with entity spans:
[Condition: Sleep apnea] or [Condition: morbid obesity] with [Mood: possible] [Condition: sleep apnea]